What is caused by a gain-of-function mutation in CLCN2?

A gain-of-function mutation in the CLCN2 chloride channel gene causes primary aldosteronism, which is the most common and curable form of arterial hypertension.